Which human chromosome is the product of fusion?

Human chromosome 2 originated from the fusion of two ancestral primate chromosomes.